Heat-shock proteins可被用來促進實	性腫瘤疫苗（tumor vaccine）的作用，其機轉為何？
A. 幫助抗原呈獻細胞（antigen-presenting cell）的增生
B. 促進抗原呈獻細胞（antigen-presenting cell）的co-stimulating molecules的表現
C. 幫助tumor antigen在MHC（major histocompatibility complex）class I分子的呈現
D. 幫助抗原呈獻細胞（antigen-presenting cell）對腫瘤細胞的耐受性

正確答案：C. 幫助tumor antigen在MHC（major histocompatibility complex）class I分子的呈現